La cápside de los adenovirus se ensambla en:
1. Núcleo.
2. Retículo endoplasmático.
3. Cara interna de la membrana citoplasmática.
4. Citosol.

Respuesta correcta: 1. Núcleo.